Known Pulmonary Hypertension

The above is a clinical trial exclusion criterion. Annotated with entity spans:
Known [Condition: Pulmonary Hypertension]